Clinical trial exclusion criterion:
Patients with infection with the known Human Immunodeficiency Virus (HIV).

Annotated entities:
- Condition: "Human Immunodeficiency Virus (HIV)"